Clinical trial exclusion criterion:
HIV infected

Annotated entities:
- Condition: "HIV infected"